Clinical trial inclusion criterion:
Possible or probable Alzheimer's disease (National Institute of Neurological and Communicative Disorders and Stroke - Alzheimer's Disease and Related Disorders Association (NINCDS-ADRDA) criteria), with Mini-Mental State Exam (MMSE) score of 10-26 inclusive; MMSE scores above 26 in those who nevertheless meet criteria for AD may be allowed with Steering Committee approval on a case by case basis

Annotated entities:
- Condition: "Alzheimer's disease"
- Measurement: "National Institute of Neurological and Communicative Disorders and Stroke - Alzheimer's Disease and Related Disorders Association (NINCDS-ADRDA) criteria"
- Value: "probable"
- Value: "Possible"
- Measurement: "Mini-Mental State Exam (MMSE)"
- Value: "score of 10-26 inclusive"
- Measurement: "MMSE"
- Value: "scores above 26"
- Condition: "AD"